Clinical trial exclusion criterion:
orthodontic appliance

Annotated entities:
- Device: "orthodontic appliance"